Estimated glomerular filtration rate (eGFR) > 30 ml/min

The above is a clinical trial inclusion criterion. Annotated with entity spans:
[Measurement: Estimated glomerular filtration rate (eGFR)] [Value: > 30 ml/min]